Clinical trial inclusion criteria:
RA cohort: Receiving MTX at stable doses of 10 to 25 mg weekly for at least 12 weeks, Have a DAS28 of 3.2 or higher (The level of disease activity is considered to be low if the DAS28 is 3.2 or less) (Prevoo et al., 1995)
OA cohort: Diagnosis of osteoarthritis made by physician.

Annotated entities:
- Condition: "RA"
- Drug: "MTX"
- Multiplier: "stable doses"
- Multiplier: "10 to 25 mg weekly"
- Temporal: "for at least 12 weeks"
- Measurement: "DAS28"
- Value: "3.2 or higher"
- Non-representable: "(The level of disease activity is considered to be low if the DAS28 is 3.2 or less) (Prevoo et al., 1995)"
- Condition: "OA"
- Condition: "osteoarthritis"
- Observation: "made by physician"